Which two antibodies directed towards the CGRP ligand, were approved by the FDA in September 2018.

Two antibodies, fremanezumab and galcanezumab, directed towards the CGRP ligand, were approved by the FDA in September 2018.